allergies to any medications used in the study

The above is a clinical trial exclusion criterion. Annotated with entity spans:
[Condition: allergies] to any [Drug: medications used in the study]